Clinical trial exclusion criteria:
Any previous treatments for active CSC;
Previous prescription of mineralocorticoid receptor antagonists, for cCSC or for other diseases;
Current treatment with corticosteroids (topical or systemic), corticosteroid use within 3 months before possible start of trial treatment, or anticipated start of corticosteroid treatment within the first 2 years from the start of the trial period;
Evidence of another diagnosis that can explain serous SRF or visual loss;
Best-corrected visual acuity < 20/200 (Snellen equivalent);
Profound chorioretinal atrophy in central macular area on ophthalmoscopy and OCT;
Myopia > 6D;
Visual loss and/or serous detachment on OCT < 6 weeks;
Continuous and/or progressive visual loss > 18 months or serous detachment on OCT > 18 months;
No hyperfluorescence on ICGA;
Intraretinal edema on OCT;
(relative) Contraindications for FA or ICGA;
(relative) Contraindications for photodynamic treatment (pregnancy, porphyria, severely disturbed liver function). Pregnancy will not be routinely tested in female patients, but the possibility of pregnancy will be discussed during screening
(relative) Known contraindications for initiation of eplerenone treatment (hyperkalemia, abnormal renal clearance, severe hepatic insufficiency (Child-Pugh C), type 2 diabetes mellitus with microalbuminuria, concomitant use of potassium supplements, potassium-sparing diuretics, strong CYP3A4 inhibitors, or the combination of an ACE-inhibitor and an angiotensin receptor blocking agent). Pregnancy will not be routinely tested in female patients, but the possibility of pregnancy will be discussed during screening;
Soft drusen in treated eye or fellow eye, signs of choroidal neovascularization on ophthalmoscopy and/or FA/ICGA of the study eye.

Annotated entities:
- Qualifier: "active"
- Condition: "CSC"
- Procedure: "treatments"
- Temporal: "previous"
- Temporal: "Previous"
- Drug: "mineralocorticoid receptor antagonists"
- Condition: "cCSC"
- Condition: "other diseases"
- Drug: "corticosteroids"
- Temporal: "Current"
- Qualifier: "topical"
- Qualifier: "systemic"
- Procedure: "corticosteroid use"
- Temporal: "within 3 months before possible start of trial treatment"
- Reference_point: "possible start of trial treatment"
- Procedure: "corticosteroid treatment"
- Temporal: "within the first 2 years from the start of the trial period"
- Reference_point: "the first 2 years from the start of the trial period"
- Mood: "anticipated"
- Non-representable: "Evidence of another diagnosis that can explain serous SRF or visual loss;"
- Measurement: "Best-corrected visual acuity"
- Value: "< 20/200"
- Qualifier: "Profound"
- Condition: "chorioretinal atrophy"
- Qualifier: "central macular area"
- Procedure: "ophthalmoscopy"
- Procedure: "OCT"
- Measurement: "Myopia"
- Value: "> 6D"
- Condition: "Visual loss"
- Condition: "serous detachment"
- Procedure: "OCT"
- Temporal: "< 6 weeks"
- Qualifier: "Continuous"
- Qualifier: "progressive"
- Condition: "visual loss"
- Temporal: "> 18 months"
- Condition: "serous detachment"
- Procedure: "OCT"
- Temporal: "> 18 months"
- Measurement: "ICGA"
- Value: "hyperfluorescence"
- Negation: "No"
- Condition: "Intraretinal edema"
- Procedure: "OCT"
- Condition: "Contraindications"
- Procedure: "FA"
- Procedure: "ICGA"
- Condition: "Contraindications"
- Procedure: "photodynamic treatment"
- Condition: "pregnancy"
- Condition: "porphyria"
- Qualifier: "severely"
- Condition: "disturbed liver function"
- Non-representable: "Pregnancy will not be routinely tested in female patients, but the possibility of pregnancy will be discussed during screening"
- Condition: "contraindications"
- Drug: "eplerenone"
- Condition: "hyperkalemia"
- Condition: "abnormal renal clearance"
- Measurement: "renal clearance"
- Value: "abnormal"
- Condition: "severe hepatic insufficiency"
- Measurement: "Child-Pugh"
- Value: "C"
- Condition: "type 2 diabetes mellitus"
- Condition: "microalbuminuria"
- Temporal: "concomitant"
- Drug: "potassium supplements"
- Drug: "potassium-sparing diuretics"
- Drug: "strong CYP3A4 inhibitors"
- Drug: "ACE-inhibitor"
- Drug: "angiotensin receptor blocking agent"
- Non-representable: "Pregnancy will not be routinely tested in female patients, but the possibility of pregnancy will be discussed during screening;"
- Condition: "Soft drusen"
- Qualifier: "treated eye"
- Qualifier: "fellow eye"
- Condition: "choroidal neovascularization"
- Procedure: "ophthalmoscopy"
- Procedure: "FA"
- Procedure: "ICGA"
- Qualifier: "study eye"